Scheduled for total hip replacement surgery

The above is a clinical trial inclusion criterion. Annotated with entity spans:
[Mood: Scheduled for] [Procedure: total hip replacement surger]y